Clinical trial exclusion criterion:
Smoker or former smoker.

Entity relations:
- OR("Smoker", "former smoker")